Clinical trial inclusion criterion:
Adult patient, age 18-80 years old, with ruptured aneurysm(s) who experience cerebral vasospasm post operatively within 3-21 days.

Annotated entities:
- Person: "Adult"
- Person: "age"
- Value: "18-80 years old"
- Condition: "ruptured aneurysm"
- Condition: "cerebral vasospasm"
- Temporal: "post operatively within 3-21 days"
- Reference_point: "post operatively"